Clinical trial exclusion criterion:
obviously poor compliance.

Entity relations:
- Has_qualifier("poor compliance", "obviously")